Clinical trial exclusion criterion:
1. Justification: The population of interest here is a healthy control population with no substance use disorder. Current use of illicit substances could impact on seizure threshold and is therefore contra-indicated for TMS.

Annotated entities:
- Parsing_Error: "1."
- Not_a_criteria: "Justification: The population of interest here is a healthy control population with no substance use disorder."
- Parsing_Error: "Justification: The population of interest here is a healthy control population with no substance use disorder."
- Parsing_Error: "Current use of illicit substances could impact on seizure threshold and is therefore contra-indicated for TMS."
- Not_a_criteria: "Current use of illicit substances could impact on seizure threshold and is therefore contra-indicated for TMS."